Clinical trial inclusion criterion:
Hyperhydration

Annotated entities:
- Condition: "Hyperhydration"